Clinical trial exclusion criterion:
Individuals with non-MRI compatible aneurysm clips

Entity relations:
- Has_negation("MRI compatible", "non")
- Has_qualifier("aneurysm clips", "MRI compatible")